Age between 20 and 40

The above is a clinical trial inclusion criterion. Annotated with entity spans:
[Person: Age] [Value: between 20 and 40]